Clinical trial inclusion criterion:
Physician diagnosis of chronic heart failure, American Heart Association Stage C-D

Annotated entities:
- Condition: "chronic heart failure"
- Measurement: "American Heart Association Stage"
- Value: "C-D"